Clinical trial inclusion criterion:
Women with POI: For the purpose of the research women is considered to have POI if she is aged less than 40 years and has amenorrhea of at least 4 month with FSH level above 25 IU/L (repeated twice >4 weeks apart).

Entity relations:
- AND("Women", "POI")
- Has_value("aged", "less than 40 years")
- Has_temporal("repeated twice", ">4 weeks apart")
- Has_value("FSH level", "above 25 IU/L")
- Has_multiplier("FSH level", "repeated twice")
- Has_temporal("amenorrhea", "at least 4 month")
- AND("amenorrhea", "FSH level")
- AND("POI", "aged")
- AND("POI", "amenorrhea")